En la replicación eucariótica, ¿qué polimerasa es análoga a la primasa de E. coli?:
1. DNA polimerasa α.
2. DNA polimerasa β.
3. DNA polimerasa γ.
4. DNA polimerasa ε.

Respuesta correcta: 1. DNA polimerasa α.